Señale cuál de las siguientes enfermedades maculares NO es típica de un ojo con miopía grave:
1. Neovascularización coroidea.
2. Desprendimiento regmatógeno de retina por agujero macular.
3. Maculopatía traccional.
4. Vasculopatía coroidea polipoidea.

Respuesta correcta: 4. Vasculopatía coroidea polipoidea.